En cuanto técnica inmunoanalítica, la citometría de flujo está basada principalmente en la detección de señales:
1. Quimioluminiscentes.
2. Fluorescentes.
3. Bioluminiscentes.
4. Piezoeléctricas.
5. Magnéticas.

Respuesta correcta: 2. Fluorescentes.